Subject is able and willing to give informed consent.

The above is a clinical trial inclusion criterion. Annotated with entity spans:
[Informed_consent: Subject is able and willing to give informed consent].